En la Enfermedad de Chagas, el “Signo de Romaña” se define como:
1. Una linfadenitis sistémica aguda.
2. Un edema biparpebral unilateral.
3. Una miocarditis aguda.
4. Un bloqueo completo auroventricular.
5. Una meningoencefalitis granulomatosa.

Respuesta correcta: 2. Un edema biparpebral unilateral.